Clinical trial exclusion criterion:
Patients aged <18 years of age

Entity relations:
- Has_value("aged", "<18 years of age")